Mayo score (including sigmoidoscopy unless performed in previous 3 months)

The above is a clinical trial inclusion criterion. Annotated with entity spans:
[Procedure: Mayo score] (including [Procedure: sigmoidoscopy] unless performed in previous 3 months)